Which gene fusion is the result of the "philadelphia translocation" or the "philadelphia chromosome" mutation?

The Philadelphia chromosome is recognized as the cytogenetic result of a rearrangement of the ABL gene on chromosome 9 and the BCL gene on chromosome 22, which leads to the creation of a BCR/ABL fusion gene on chromosome 22.